一位 12 歲女學生到骨科門診要求檢查是否有脊柱側彎。對於判斷是否有脊柱側彎的理學檢查中，下列何者最為重要？
A. 亞當氏脊椎前彎測試（Adams forward bend test）
B. 派屈克氏測試（Patrick's test）
C. 蕭鉑氏脊椎前彎測試（Schober's test）
D. 坐及肢體軀幹前彎測試（sit and reach test）

正確答案：A. 亞當氏脊椎前彎測試（Adams forward bend test）